以下有關縱隔腔 Germ cell tumor 之敘述，何者錯誤？
A. 最常見的良性腫瘤為 Teratoma
B. 惡性腫瘤可分為 Seminoma 與 Nonseminomatous tumor 兩大類
C. Teratoma 的治療以手術切除為主
D. Nonseminomatous tumor 以放射治療為主

正確答案：D. Nonseminomatous tumor 以放射治療為主